Clinical trial exclusion criterion:
Prior receipt of investigational anti-HIV vaccine

Annotated entities:
- Temporal: "Prior"
- Qualifier: "investigational"
- Drug: "anti-HIV vaccine"